Clinical trial exclusion criteria:
Cardiac morbidities
Hypertensive disorders of pregnancy,
Peripartum bleeding
Baseline systolic blood pressure (SBP) < 100 mmHg
Body mass index > 35

Annotated entities:
- Condition: "Cardiac morbidities"
- Condition: "Hypertensive disorders of pregnancy"
- Condition: "Peripartum bleeding"
- Temporal: "Baseline"
- Measurement: "systolic blood pressure"
- Measurement: "SBP"
- Value: "< 100 mmHg"
- Measurement: "Body mass index"
- Value: "> 35"